Clinical trial exclusion criterion:
Alcohol or drug dependency

Entity relations:
- OR("Alcohol dependency", "drug dependency")